一位 50 歲之網球愛好者，連續 2 週密集參加網球比賽後發覺肘關節外側疼痛，強力腕關節背曲活動加重其症狀，則最可能傷到那條肌腱？
A. 橈側屈腕肌（Flexor carpi radialis）
B. 肱肌（Brachialis）
C. 橈側伸腕短肌（Extensor carpi radialis brevis）
D. 旋前圓肌（Pronator teres）

正確答案：C. 橈側伸腕短肌（Extensor carpi radialis brevis）